Clinical trial exclusion criterion:
Abnormal serum glucose levels either at fasting or after the 2-hr oral glucose tolerance test meeting criteria for the diagnosis of diabetes mellitus according to the American Diabetes Association.

Annotated entities:
- Value: "Abnormal"
- Measurement: "serum glucose levels"
- Condition: "Abnormal serum glucose levels"
- Temporal: "at fasting"
- Temporal: "after the 2-hr oral glucose tolerance test"
- Reference_point: "the 2-hr oral glucose tolerance test"
- Procedure: "2-hr oral glucose tolerance test"
- Reference_point: "fasting"
- Measurement: "criteria for the diagnosis of diabetes mellitus according to the American Diabetes Association"
- Value: "meeting"
- Qualifier: "meeting criteria for the diagnosis of diabetes mellitus according to the American Diabetes Association"
- Condition: "diabetes mellitus"